Clinical trial exclusion criterion:
Allergy to the used local anesthetics

Entity relations:
- AND("Allergy", "local anesthetics")